Clinical trial inclusion criterion:
Patient with moderate or severe chronic atopic dermatitis

Annotated entities:
- Condition: "chronic atopic dermatitis"
- Qualifier: "severe"
- Qualifier: "moderate"